Stable prednisone <10mg or equivalent

The above is a clinical trial inclusion criterion. Annotated with entity spans:
[Multiplier: Stable] [Drug: prednisone] [Value: <10mg] or equivalent